Clinical trial exclusion criterion:
Patients with congenital heart defects.

Annotated entities:
- Condition: "congenital heart defects"